En una célula electroquímica, el electrólito soporte sirve para:
1. Que se cumpla el principio de electroneutralidad en la disolución.
2. Que se electrolicen preferentemente sus iones con el fin de prevenir el consumo de sustancia electroactiva.
3. Que en la célula exista transporte por migración, con el fin de lograr una mayor sensibilidad.
4. Que la disolución posea una conductividad eléctrica adecuada.
5. Favorecer el transporte por difusión de la sustancia electroactiva.

Respuesta correcta: 4. Que la disolución posea una conductividad eléctrica adecuada.